Clinical trial exclusion criterion:
Patients with Guillain-Barré syndrome radiculopathy of vascular origin.

Entity relations:
- Has_qualifier("Guillain-Barré syndrome radiculopathy", "vascular")